Clinical trial inclusion criterion:
Surgery intent within 4 weeks

Entity relations:
- Has_mood("Surgery", "intent")
- Has_temporal("Surgery", "within 4 weeks")